安非他命至今仍為美國食品藥品檢驗局認定為是何種病的治療藥物？
A. 老年性憂鬱症
B. 頭部外傷
C. 麻醉性昏睡
D. 慢性疼痛

正確答案：C. 麻醉性昏睡